Clinical trial exclusion criterion:
renal insufficiency III-V °

Annotated entities:
- Condition: "renal insufficiency"
- Qualifier: "III-V °"